Any history of substance abuse (other than tobacco)

The above is a clinical trial exclusion criterion. Annotated with entity spans:
Any history of [Condition: substance abuse] ([Negation: other] than [Observation: tobacco])